Clinical trial exclusion criterion:
History of kidney stones

Entity relations:
- Has_temporal("kidney stones", "History")